有關病媒（vector）及其媒介疾病之關係，下列何者錯誤？
A. 埃及斑蚊（Aedes aegypti）傳播黃熱病（yellow fever）
B. 蚋（Simulium spp.）傳播河川盲（river blindness）
C. 采采蠅（tsetse fly）傳播卡格氏症（Chagas'disease）
D. 白蛉（sandfly）傳播利什曼原蟲症（leishmaniasis）

正確答案：C. 采采蠅（tsetse fly）傳播卡格氏症（Chagas'disease）